Clinical trial exclusion criterion:
Evidence of type 1 diabetes and diabetics requiring insulin therapy.

Entity relations:
- multi("insulin therapy", "insulin")
- multi("requiring insulin therapy", "insulin therapy")
- Has_qualifier("diabetics", "requiring insulin therapy")
- OR("type 1 diabetes", "diabetics")